Clinical trial inclusion criterion:
Subjects must have normal organ and marrow function as defined below:

Annotated entities:
- Condition: "normal organ function"
- Condition: "normal marrow function"